Clinical trial inclusion criteria:
Able to give fully informed consent in writing
Males or females aged >/= 50 years
No significant disease or drug use
Absence of any sign of dementia/cognitive impairment in neuropsychological examinationsPatients for brain imaging:
Patient and designee capable of giving fully informed consent in writing
Patient fulfils DSM-IV and NINCDS-ADRA criteria for probable Alzheimers disease

Annotated entities:
- Post-eligibility: "Able to give fully informed consent in writing"
- Person: "Males"
- Person: "females"
- Person: "aged"
- Value: ">/= 50 years"
- Condition: "drug use"
- Condition: "disease"
- Qualifier: "significant"
- Subjective_judgement: "significant"
- Negation: "No"
- Condition: "dementia"
- Condition: "sign of dementia"
- Condition: "sign of cognitive impairment"
- Condition: "cognitive impairment"
- Negation: "Absence of"
- Procedure: "neuropsychological examinations"
- Parsing_Error: "Patients for brain imaging:"
- Post-eligibility: "Patient and designee capable of giving fully informed consent in writing"
- Measurement: "DSM-IV criteria"
- Measurement: "NINCDS-ADRA criteria"
- Condition: "Alzheimers disease"
- Mood: "probable"
- Value: "fulfils"